Current medications with CNS effects

The above is a clinical trial exclusion criterion. Annotated with entity spans:
Current [Drug: medications] with [Condition: CNS effects]